Poorly controlled hypertension

The above is a clinical trial exclusion criterion. Annotated with entity spans:
[Qualifier: Poorly controlled] [Condition: hypertension]